有一個研究進行迴歸分析，若決定係數（coefficient of determination）R2為 0.25。下列敘述何者正確？
A. 此相關達統計顯著
B. 此相關的相關係數（correlation coefficient）一定為+0.5
C. 此樣本很可能抽自一個相關係數為 0 的母群體
D. 此相關中的自變項 X 可解釋依變項 Y 變異的 25%

正確答案：D. 此相關中的自變項 X 可解釋依變項 Y 變異的 25%